一位1歲2個月大的男孩因近1個月來臉色蒼白、胃口降低、活動力較差到門診求診，理學檢查發現肝臟及脾臟有腫大現象，血液常規檢查結果如下：WBC 8,100/mm3，segment 55%，lymphocyte 42%， RBC 2.30×106/mm3，Hb 4.0 g/dL，MCV 59 fL，MCH 16 pg，血小板290,000/mm3，reticulocyte 5.2%。他最有可能是下列那一種疾病？
A. 重型α型海洋性貧血症（α-thalassemia）
B. 重型β型海洋性貧血症（β-thalassemia）
C. 白血病（acute leukemia）
D. 再生不良性貧血症（aplastic anemia）

正確答案：B. 重型β型海洋性貧血症（β-thalassemia）